溫度感覺受器主要為 transient receptor potential（Trp）cation channels。有關其特性之敘述，下列何者錯誤？
A. 為陽離子通道
B. capsaicin 可活化 TrpV1 受器亞型
C. TrpM8 為冷覺受器
D. 冷覺受器被活化時，會造成其細胞膜過極化

正確答案：D. 冷覺受器被活化時，會造成其細胞膜過極化